王小姐45歲，未婚，最近發現左側乳房有小塊腫瘤，經醫師診斷為乳癌，進行手術切除後，並給予 cyclophosphamide, methotrexate及5-fluorouracil癌症化學治療，下列藥物與機轉之配對何者正確？
A. cyclophosphamide & methotrexate：抑制topoisomerase II
B. methotrexate & 5-fluorouracil：抑制有絲分裂（mitosis）
C. methotrexate & 5-fluorouracil：抗代謝藥物（anti-metabolites）
D. cyclophosphamide & 5-fluorouracil：DNA烷基化物（DNA alkylating agents）

正確答案：C. methotrexate & 5-fluorouracil：抗代謝藥物（anti-metabolites）